Clinical trial exclusion criterion:
Allergic to study drugs

Entity relations:
- AND("Allergic", "study drugs")